Clinical trial exclusion criterion:
Debilitating stroke within 90 days before inclusion

Annotated entities:
- Temporal: "within 90 days before inclusion"
- Condition: "stroke"
- Condition: "Debilitating"